Clinical trial exclusion criterion:
Administration of another investigational drug within 1 month before screening or planned during the study period

Annotated entities:
- Competing_trial: "Administration of another investigational drug within 1 month before screening or planned during the study period"